Clinical trial exclusion criterion:
Local or systemic drug use which interacts with the outcome measures.

Entity relations:
- Has_qualifier("drug", "Local")
- Has_qualifier("drug", "interacts with the outcome measures")
- OR("Local", "systemic")